Clinical trial inclusion criterion:
Diagnosis of uncomplicated gastroschisis

Annotated entities:
- Qualifier: "uncomplicated"
- Condition: "gastroschisis"